下列何者與血中鈣濃度的調節無關？
A. 副甲狀腺荷爾蒙
B. 維他命 D
C. 抑鈣激素
D. 雌性激素

正確答案：D. 雌性激素